Preoperative renal failure (defined as a serum creatinine > 2.0 mg/dL.)

The above is a clinical trial exclusion criterion. Annotated with entity spans:
[Temporal: Preoperative] [Condition: renal failure] (defined as a [Measurement: serum creatinine] [Value: > 2.0 mg/dL].)